Clinical trial exclusion criterion:
use of concurrent,non-stimulant psychoactive medication

Annotated entities:
- Temporal: "concurrent"
- Drug: "non-stimulant psychoactive medication"